Trastuzumab ≤ 21 days prior to randomization.

The above is a clinical trial exclusion criterion. Annotated with entity spans:
[Drug: Trastuzumab] [Temporal: ≤ 21 days prior to randomization].